Are currently abstinent and do not agree to use a double-barrier method (as described above) or refrain from sexual activity during the study period and for 28 days after study drug discontinuation

The above is a clinical trial exclusion criterion. Annotated with entity spans:
Are [Temporal: currently] [Condition: abstinent] and [Observation: do not agree] to use a [Observation: double-barrier method] (as described above) or [Negation: refrain] from [Observation: sexual activity] [Temporal: during the study period] and [Temporal: for 28 days after study drug discontinuation]